Subjects with any pre or intra-operative findings identified by the surgeon that may preclude conduct of the study procedure.

The above is a clinical trial exclusion criterion. Annotated with entity spans:
[Non-query-able: Subjects with any pre or intra-operative findings identified by the surgeon that may preclude conduct of the study procedure].